Señale la respuesta INCORRECTA. Los sistemas de información de enfermería suponen:
1. Aumento de satisfacción en el trabajo de la enfermera.
2. Reducción de los errores por omisión.
3. Disminución del tiempo que se pasa con los pacientes.
4. Aumento de la satisfacción en el trabajo.

Respuesta correcta: 3. Disminución del tiempo que se pasa con los pacientes.